Clinical trial inclusion criterion:
Oral body temperature within the range 35.0-37.5 °C

Annotated entities:
- Measurement: "Oral body temperature"
- Value: "35.0-37.5 °C"